Age = 15 years old

The above is a clinical trial inclusion criterion. Annotated with entity spans:
[Person: Age] [Value: = 15 years old]